DKA(Diabetic Ketoacidosis) or HHS(Hyperosmoloar Hyperglycaemic Syndrome) within the last 6 months

The above is a clinical trial exclusion criterion. Annotated with entity spans:
[Condition: DKA]([Condition: Diabetic Ketoacidosis]) or [Condition: HHS]([Condition: Hyperosmoloar Hyperglycaemic Syndrome]) [Temporal: within the last 6 months]